La molécula CD40 ligando (CD40L o CD154) se expresa en:
1. Linfocitos T vírgenes.
2. Linfocitos T activados.
3. Linfocitos NK.
4. Linfocitos B vírgenes.
5. Linfocitos B activados.

Respuesta correcta: 2. Linfocitos T activados.